Absence of oral lesions

The above is a clinical trial inclusion criterion. Annotated with entity spans:
[Negation: Absence] of [Condition: oral lesions]